下列氧化劑（oxidant）中，何者的標準還原電位（standard reduction potential）值最小？
A. cytochrome b (+3)
B. ubiquinone (oxidized)
C. FAD
D. Fe (+3)

正確答案：C. FAD